In what phase of clinical trials is crenezumab? (November 2017)

Crenezumab is undergoing phase III clinical trials.